Exclusion Criteria patients: Substance abuse on a daily basis during the last 3 month or patients fulfilling the criteria of ongoing substance abuse due to ICD-10/DSM-IV/V, Treatment with antidepressant during the last 30 days, Head injury with more than 5 minutes of unconsciousness, Patients involuntarily admitted or treated, Components of metal implanted by operation, Pacemaker, Pregnancy, Severe physical illness

The above is a clinical trial exclusion criterion. Annotated with entity spans:
Exclusion Criteria [Observation: patients]: [Condition: Substance abuse] on a [Multiplier: daily basis] [Multiplier: during the last 3 month] or patients fulfilling the criteria of [Temporal: ongoing] [Condition: substance abuse] due to [Qualifier: ICD-10/DSM-IV/V], Treatment with [Drug: antidepressant] [Temporal: during the last 30 days], [Condition: Head injury] with [Multiplier: more than 5 minutes] of [Condition: unconsciousness], Patients [Observation: involuntarily admitted] or treated, [Device: Components of metal] implanted by operation, [Device: Pacemaker], [Condition: Pregnancy], [Condition: Severe physical illness]